Clinical trial exclusion criterion:
G-6-PD deficiency

Annotated entities:
- Condition: "G-6-PD deficiency"